以下有關單側聲帶麻痺（unilateral vocal palsy）之敘述，何者錯誤？
A. 手術外傷是成年人單側聲帶麻痺中最常見的原因
B. 主要為喉上神經（superior laryngeal nerve）受影響
C. 左側發生機率較右側常見
D. 治療可先觀察 6-12 個月再施行手術

正確答案：B. 主要為喉上神經（superior laryngeal nerve）受影響